Clinical trial exclusion criterion:
Born prior to 34 weeks

Annotated entities:
- Person: "Born"
- Value: "prior to 34 weeks"